一位 25 歲的男性健康檢查時意外發現一個後縱膈腔腫瘤，電腦斷層掃描顯示該腫瘤是一個啞鈴形、邊緣完整的腫瘤，腫瘤的一部分延伸到脊柱內，以下那一個診斷最有可能？
A. lymphoma
B. thymoma
C. neurogenic tumor
D. germ cell tumor

正確答案：C. neurogenic tumor